2. ST elevation in 2 contiguous ECG leads (= 2 mm precordial lead, = 1 mm limb lead). This ECG recording serves as baseline ECG, i.e. ECG I.

The above is a clinical trial inclusion criterion. Annotated with entity spans:
2. [Condition: ST elevation] in [Value: 2] [Measurement: contiguous ECG leads] (= [Value: 2 mm] [Measurement: precordial lead], = [Value: 1 mm] [Measurement: limb lead]). This ECG recording serves as baseline ECG, i.e. ECG I.